張先生腎臟衰竭到了末期，接受透析治療一段時間後，接到醫院的通知，可以準備接受腎臟移植。有一陌生捐贈者車禍致腦死，將捐出器官，其中一枚腎臟配給張先生。張先生與捐贈者的主要組織相容性複合體（Major Histocompatibility Complex）測試定型是完全相同的。那麼張先生腎臟移植之後，其預後情形可能為何？
A. 將不會有排斥反應，因為主要組織相容性複合體經測試定型是完全相同的
B. 將不會有排斥反應，因為次要組織相容性複合體也是完全相同的
C. 將會有排斥反應，因為即使主要組織相容性複合體相同，其他的組織抗原可能不一樣，也會引起免疫反應
D. 將會有排斥反應，因為張先生腎臟移植之前，按程序須先接受身體放射準備（total body irradiation）所致

正確答案：C. 將會有排斥反應，因為即使主要組織相容性複合體相同，其他的組織抗原可能不一樣，也會引起免疫反應